Clinical trial exclusion criterion:
Active bleeding or at high risk of bleeding

Annotated entities:
- Qualifier: "Active"
- Condition: "bleeding"
- Qualifier: "at high risk"
- Condition: "bleeding"